What is caused by SCUBE2 loss-of-function?

Loss-of-function mutations of SCUBE2 lead to premature differentiation of osteoblast differentiation, bone formation and endochondral bone formation. Down-regulation of hedgehog signaling promotes the formation of osteoblasts, adipogenesis.